Clinical trial inclusion criterion:
3. Residence in AFRH-Washington D.C. or the Veterans Home of California-Yountville

Annotated entities:
- Visit: "AFRH-Washington D.C."
- Visit: "Veterans Home of California-Yountville"
- Observation: "Residence"